Clinical trial exclusion criterion:
Patients with systolic blood pressure <100 mmHg or basal heart rate <60/min

Annotated entities:
- Measurement: "systolic blood pressure"
- Value: "<100 mmHg"
- Measurement: "heart rate"
- Qualifier: "basal"
- Value: "<60/min"